Abdominal obesity (>88cm women, >102cm men) AND hypertension (treated or resting blood pressure >140/90

The above is a clinical trial inclusion criterion. Annotated with entity spans:
[Condition: Abdominal obesity] ([Value: >88cm] [Person: women], [Value: >102cm] [Person: men]) AND [Condition: hypertension] ([Procedure: treated] or [Measurement: resting blood pressure] [Value: >140/90]